How does condensin affect the function of topoisomeraseII?

Condensin prevents deleterious anaphase bridges during chromosome segregation by promoting sister chromatid decatenation.